Clinical trial exclusion criterion:
3. Planned need for major surgery (e.g. valve surgery or resection of aortic or left ventricular aneurysm, carotid end-arterectomy, abdominal aortic aneurysm surgery etc.);

Annotated entities:
- Procedure: "major surgery"
- Procedure: "valve surgery"
- Procedure: "carotid end-arterectomy"
- Procedure: "abdominal aortic aneurysm surgery"
- Procedure: "resection of left ventricular aneurysm"
- Procedure: "resection of aortic aneurysm"